Clinical trial inclusion criterion:
Written informed consent

Annotated entities:
- Post-eligibility: "Written informed consent"